At least one episode of AF must be documented during the prior year by any kind of ECG recording.

The above is a clinical trial inclusion criterion. Annotated with entity spans:
[Multiplier: At least one] [Condition: episode] of [Condition: AF] must be documented during the [Temporal: prior year] by any kind of [Measurement: ECG] recording.